Magnetic beads has been used in numerous applications. List some coatings used.

aptamers
enzymes
streptavidin
concanavalin A
carboxylic-modified 
TiO2
antibodies
SELEX library
synthesized DNA
C18
C8
oligo(dT)